下列關於脾臟手術的敘述何者錯誤？
A. 由於脾臟為造血系統及免疫系統的一環，最常需要進行脾臟切除的原因是因為紫斑症（idiopathic
B. 紫斑症於脾臟切除手術後的預後極佳，對於患者而言，是最具時間效率的一項治療
C. 手術前一週應該要接受肺炎鏈球菌疫苗注射，因為有小於5%的病患會於脾臟切除手術術後嚴重感染
D. 脾臟手術後常見的併發症為肺部塌陷、出血及胰臟發炎

正確答案：A. 由於脾臟為造血系統及免疫系統的一環，最常需要進行脾臟切除的原因是因為紫斑症（idiopathic